下列何種藥物具有阻斷 muscarinic receptor 之作用，而常用於治療巴金森氏症？
A. Oxybutynin
B. Ipratropium
C. Biperiden
D. Scopolamine

正確答案：C. Biperiden